Planned elective surgery within 30 days of the Final Study Visit.

The above is a clinical trial exclusion criterion. Annotated with entity spans:
[Mood: Planned] [Procedure: elective surgery] [Temporal: within 30 days of the Final Study Visit].